Which domain allowing self-association do exist in TDP-43 and FUS proteins?

PRION PROTEINS